Clinical trial exclusion criterion:
Pregnant females as determined by positive serum hCG test at screening or prior to dosing.

Entity relations:
- Has_value("serum hCG test", "positive")
- Subsumes("Pregnant", "serum hCG test")
- Has_index("prior to dosing", "dosing")
- Has_index("at screening", "screening")
- Has_temporal("serum hCG test", "at screening")
- OR("at screening", "prior to dosing")